Clinical trial exclusion criterion:
Active atrial fibrillation

Annotated entities:
- Condition: "atrial fibrillation"